Clinical trial exclusion criterion:
Acute infections within the last four weeks prior to Screening

Annotated entities:
- Condition: "Acute infections"
- Temporal: "within the last four weeks prior to Screening"
- Reference_point: "Screening"